Hypersensitivity to vitamin K

The above is a clinical trial exclusion criterion. Annotated with entity spans:
[Condition: Hypersensitivity] to [Drug: vitamin K]